惡性瘧之症狀較其他三種瘧疾嚴重的原因有那些？①能侵犯各種發育期的紅血球 ②較易引起復發 （relapse） ③可能併發腦性瘧（cerebral malaria） ④發作（paroxysm）時高燒持續的時間較長
A. ①②③
B. ①②④
C. ①③④
D. ②③④

正確答案：C. ①③④